Según la teoría de Rehm, ¿qué fallo del proceso de autocontrol explica en mayor medida la visión pesimista de la vida en la depresión adolescente?
1. La atención selectiva a las consecuencias inmediatas.
2. El establecimiento de metas poco realistas.
3. Las atribuciones erróneas.
4. El autorreforzamiento deficitario.
5. El castigo excesivo.

Respuesta correcta: 1. La atención selectiva a las consecuencias inmediatas.